大腸急性憩室炎（acute diverticulitis）最常引起下列那一部位之腹痛？
A. 右上腹
B. 右下腹
C. 左上腹
D. 左下腹

正確答案：D. 左下腹